Congenital or acquired thrombophilia/thrombosis event

The above is a clinical trial exclusion criterion. Annotated with entity spans:
[Qualifier: Congenital] or [Qualifier: acquired] [Condition: thrombophilia]/[Condition: thrombosis event]